下列那一種傳染病，是目前人類社會透過預防注射，最有可能根除的疾病？
A. 結核病（tuberculosis）
B. 麻疹（measles）
C. 小兒麻痺（poliomyelitis）
D. 百日咳（diphtheria）

正確答案：C. 小兒麻痺（poliomyelitis）